Clinical trial exclusion criterion:
Total bilirubin >= 2 x ULN

Entity relations:
- Has_value("Total bilirubin", ">= 2 x ULN")